History of MI, angina or congestive heart failure.

The above is a clinical trial exclusion criterion. Annotated with entity spans:
[Temporal: History] of [Condition: MI], [Condition: angina] or [Condition: congestive heart failure].